Positive alcohol (breath test) or nicotine screen at Screening Visit or Day 1 (positive nicotine screen does not apply to heterozygous cohort).

The above is a clinical trial exclusion criterion. Annotated with entity spans:
[Value: Positive] [Measurement: alcohol] ([Measurement: breath test]) or [Measurement: nicotine screen] [Temporal: at Screening Visit] or Day 1 (positive nicotine screen does not apply to heterozygous cohort).